下列何者不是黑色素細胞癌（melanoma）的危險因子？
A. 日光曝曬之下易曬黑、不易曬傷之皮膚分型
B. 長期過度日光曝曬
C. 黑色素母斑（melanocytic nevi）數目多於 100 個
D. 有黑色素細胞癌之家族史

正確答案：A. 日光曝曬之下易曬黑、不易曬傷之皮膚分型